Clinical trial exclusion criterion:
History of allergic disease or reactions likely to be exacerbated by any component of the vaccine (including egg and thiomersal allergy).

Annotated entities:
- Condition: "allergic disease"
- Condition: "allergic reactions"
- Temporal: "History"
- Condition: "egg allergy"
- Condition: "thiomersal allergy"